What percent of Rheumatoid Arthritis (RA) patients are not responding to anti-TNF therapy?

Anti-tumour necrosis factor (TNF) agents have revolutionized the treatment of patients with rheumatoid arthritis (RA). These therapies are, however, expensive and 30% of patients fail to respond.